Active malignancy

The above is a clinical trial exclusion criterion. Annotated with entity spans:
[Qualifier: Active] [Condition: malignancy]